慢性積液性中耳炎可以中耳導氣管置放術（myringotomy tube insertion）治療。中耳導氣管大約放多久就會自然排出？
A. 1 個月
B. 2 個月
C. 3 個月
D. 6 至 12 個月

正確答案：D. 6 至 12 個月